Three or more failed trials of pharmacotherapy for the current GAD episode

The above is a clinical trial inclusion criterion. Annotated with entity spans:
[Multiplier: Three or more] [Qualifier: failed] [Procedure: trials of pharmacotherapy] for the [Temporal: current] [Condition: GAD episode]